Clinical trial exclusion criterion:
having experienced severe allergies, trauma history and/or operation history within 3 months.

Annotated entities:
- Qualifier: "severe"
- Condition: "allergies"
- Condition: "trauma"
- Temporal: "history"
- Procedure: "operation"
- Temporal: "history"
- Temporal: "within 3 months"